下列何者不是鼻竇炎造成之眼眶併發症？
A. 眼眶蜂窩組織炎
B. 骨膜下膿腫
C. 乙狀竇栓塞
D. 眼眶膿腫

正確答案：C. 乙狀竇栓塞